Total lesion area of >12 DA or >30.5 mm2

The above is a clinical trial exclusion criterion. Annotated with entity spans:
[Measurement: Total lesion area] of [Value: >12 DA] or [Value: >30.5 mm2]